下列何種病毒不會引起病毒性出血熱（viral hemorrhagic fever）？
A. 拉薩病毒（Lassa virus）
B. 絲狀病毒（Filoviruses）
C. 諾瓦克病毒（Norwalk virus）
D. 黃熱病病毒（Yellow fever virus）

正確答案：C. 諾瓦克病毒（Norwalk virus）